Previous treatment with anti-VEGF drugs or corticosteroid or grid laser photocoagulation (study eye)

The above is a clinical trial exclusion criterion. Annotated with entity spans:
Previous treatment with [Drug: anti-VEGF drugs] or [Drug: corticosteroid] or [Procedure: grid laser photocoagulation (]study eye)